下列何者不是子宮內膜癌的危險因子？
A. 糖尿病
B. 遲發性停經
C. 肥胖
D. 人類乳突病毒感染（HPV infection）

正確答案：D. 人類乳突病毒感染（HPV infection）